Clinical trial exclusion criterion:
Use of one of the prohibited medications

Annotated entities:
- Post-eligibility: "Use of one of the prohibited medications"